endovascular mechanical thrombus fragmentation + thrombolytic therapy (using recombinant tissue activator of plasminogen), performed for treatment of the above-mentioned pulmonary embolism in less than 48 hours before randomization. The patient should be randomized no earlier than 24 hours after procedures endovascular mechanical thrombus fragmentation + thrombolytic therapy

The above is a clinical trial inclusion criterion. Annotated with entity spans:
[Condition: endovascular mechanical thrombus fragmentation] + [Procedure: thrombolytic therapy] (using [Drug: recombinant tissue activator of plasminogen]), performed for [Procedure: treatment] of the above-mentioned [Condition: pulmonary embolism] [Temporal: in less than 48 hours before randomization]. [Non-representable: The patient should be randomized no earlier than 24 hours after procedures endovascular mechanical thrombus fragmentation + thrombolytic therapy]